Clinical trial exclusion criterion:
HIV positive

Entity relations:
- Has_value("HIV", "positive")